Clinical trial exclusion criterion:
Contraindication to aspirin or P2Y12 receptor antagonist

Entity relations:
- AND("Contraindication", "aspirin")
- OR("aspirin", "P2Y12 receptor antagonist")